¿Cuál es un medicamento leishmanicida de reciente aparición y administración oral?:
1. Miltefosina.
2. Anfotericina B.
3. Pentamidina.
4. Paramomicina.

Respuesta correcta: 1. Miltefosina.